有關評估卵子庫存量（ovarian reserve）下降的結果，下列何者正確？
A. 濾泡刺激素（follicle stimulating hormone, FSH）基礎值下降
B. 女性的卵子庫存量與年齡無關
C. 抗穆勒氏賀爾蒙（antimüllerian hormone, AMH）下降
D. 超音波測量竇卵泡計數量（antral follicle count, AFC）上升

正確答案：C. 抗穆勒氏賀爾蒙（antimüllerian hormone, AMH）下降